頭皮血液的供應主要來自：
A. 腦膜中動脈（middle meningeal artery）
B. 顳淺動脈（superficial temporal artery）
C. 椎動脈（vertebral artery）
D. 面動脈（facial artery）

正確答案：B. 顳淺動脈（superficial temporal artery）